Clinical trial inclusion criterion:
Inflammatory arthritis patients who plan to treat with biological agents, including Humira or Enbrel or Simponi or Orencia or Mabthera or Actemra; as first line biologic treatment is indicated.

Annotated entities:
- Condition: "Inflammatory arthritis"
- Procedure: "biological agents"
- Drug: "Humira"
- Drug: "Enbrel"
- Drug: "Simponi"
- Drug: "Orencia"
- Drug: "Mabthera"
- Drug: "Actemra"